Varicose vein tributary requiring treatment

The above is a clinical trial inclusion criterion. Annotated with entity spans:
[Qualifier: Varicose vein tributary] [Mood: requiring] [Procedure: treatment]